下列何種藥物可作為早期墮胎藥（early abortion）？
A. alprostadil
B. treprostinil
C. mifepristone
D. iloprost

正確答案：C. mifepristone